Persons referred to in Articles L1121-5 to L1121-8 of the French Public health Code: pregnant woman, parturient, nursing mother, person deprived of liberty by judicial or administrative decision, person subject to a legal protection measure, can not Be included in clinical trials.

The above is a clinical trial exclusion criterion. Annotated with entity spans:
[Context_Error: Persons referred to in Articles L1121-5 to L1121-8 of the French Public health Code]: [Condition: pregnant] [Person: woman], [Condition: parturient], [Condition: nursing] mother, person [Observation: deprived of liberty] by judicial or administrative decision, person subject to a legal protection measure, can not Be included in clinical trials.